Clinical trial exclusion criterion:
Brain metastases that are untreated, symptomatic, or require therapy to control symptoms or any radiation, surgery, or other therapy to control symptoms from brain metastases within 2 months prior to randomization.

Entity relations:
- multi("within 2 months prior to randomization", "randomization")
- Has_temporal("brain metastases", "within 2 months prior to randomization")
- causal("radiation", "brain metastases")
- Has_qualifier("Brain metastases", "untreated")
- OR("radiation", "surgery", "other therapy to control symptoms")
- OR("untreated", "require therapy", "symptomatic")
- OR("Brain metastases", "radiation")